下列關於小 RNA 病毒科（Picornaviridae）病毒之敘述，何者錯誤？
A. 其基因體為單股正向 RNA
B. 構造具二十面體對稱
C. 具有外套膜（envelope）可以抵抗外界不良環境
D. 包括腸病毒、鼻病毒、心肌病毒等各屬

正確答案：C. 具有外套膜（envelope）可以抵抗外界不良環境